Clinical trial exclusion criteria:
Allergy to narcotic medications
Intake of any chronic opioids or pain medications preoperatively

Annotated entities:
- Condition: "Allergy"
- Drug: "narcotic medications"
- Multiplier: "chronic"
- Drug: "opioids"
- Qualifier: "any"
- Drug: "pain medications"
- Temporal: "preoperatively"